腦中風病人容易併發反射性交感神經失養症（Reflex sympathetic dystrophy），下列何者不是其典型的症狀？
A. 肩痛
B. 手肘活動度受限
C. 手腕水腫
D. 手背皮膚變薄

正確答案：B. 手肘活動度受限